Clinical trial exclusion criterion:
Receipt of oral or injectable antibiotic therapy within 72 hours prior to the first blood draw

Entity relations:
- Has_index("within 72 hours prior to the first blood draw", "the first blood draw")
- Has_temporal("antibiotic therapy", "within 72 hours prior to the first blood draw")
- Has_qualifier("antibiotic therapy", "oral")
- OR("oral", "injectable")